Clinical trial inclusion criterion:
Planned to start docetaxel component of FEC-D or AC-D, or first cycle of; dose-dense AC-T, TC, FEC-D or TAC chemotherapy

Annotated entities:
- Drug: "docetaxel"
- Mood: "Planned to start"
- Procedure: "FEC-D"
- Procedure: "AC-D"
- Multiplier: "first cycle of"
- Procedure: "dose-dense AC-T"
- Procedure: "TC"
- Procedure: "FEC-D"
- Procedure: "TAC chemotherapy"